Todos los componentes de la cadena respiratoria:
1. Bombean protones.
2. Intercambian electrones.
3. Son complejos de alto peso molecular.
4. Son proteínas de membrana.
5. Son solubles.

Respuesta correcta: 2. Intercambian electrones.